下列關於功能性腸胃道疾患（functional gastrointestinal disorders）的敘述何者錯誤？
A. 許多患有心身症狀者時常以腸胃道症狀表現
B. 腸胃道疾病當中，有相當高比例為功能性疾患
C. 對於功能性腸胃道疾患，心理因素時常會影響疾病的嚴重度與預後
D. 焦慮不太會導致功能性腸胃道疾患

正確答案：D. 焦慮不太會導致功能性腸胃道疾患